Clinical trial inclusion criterion:
History of hypersensitivity to any of the study drugs or its excipients or to drugs of similar chemical classes.

Annotated entities:
- Condition: "hypersensitivity"
- Drug: "study drugs"
- Drug: "excipients"
- Drug: "drugs of similar chemical classes"